下列何種可吸收的縫線最能持久？
A. Catgut
B. Coated vicryl
C. Dexon
D. PDS

正確答案：D. PDS